下列有關表面活性劑（surfactant）之敘述，何者錯誤？
A. 為第二型肺泡細胞所分泌
B. 可降低肺泡的表面張力
C. 小量且持續的呼吸型態可降低其分泌量
D. 可降低肺順應性（lung compliance）

正確答案：D. 可降低肺順應性（lung compliance）